有關腦中風之治療，下列敘述何者錯誤？
A. 大多數腦中風病人的血壓，會在疼痛、躁動、腦壓受控制後自然降低
B. 缺血性腦中風，收縮壓＞200 mmHg，舒張壓＞100 mmHg以上時，要緊急降壓
C. 針對3小時內缺血性腦中風病人，適合給r-tPA治療者，可改善神經學預後
D. 以r-tPA治療缺血性腦中風之劑量，最大量不超過90 mg

正確答案：B. 缺血性腦中風，收縮壓＞200 mmHg，舒張壓＞100 mmHg以上時，要緊急降壓